下列那一條動脈是升主動脈（ascending aorta）的分支？
A. 內胸動脈（internal thoracic artery）
B. 冠狀動脈（coronary artery）
C. 支氣管動脈（bronchial artery）
D. 肋間動脈（intercostal artery）

正確答案：B. 冠狀動脈（coronary artery）